病人之聽理解力尚可，口語表達很差，但是複誦口語（repetition）能力佳，這是何種失語症（aphasia）？
A. 布羅卡（Broca's）
B. 渥尼卡（Wernicke's）
C. 經皮質運動型（transcortical motor）
D. 經皮質感覺型（transcortical sensory）

正確答案：C. 經皮質運動型（transcortical motor）